一名 30 歲女性，因兩個星期來有發燒、下腹部疼痛及陰道分泌物等症狀就醫，骨盆腔檢查發現右側卵巢處有腫塊存在，腹腔鏡檢查發現右側卵巢與輸卵管形成一個 6 公分大的紅色發炎性腫塊。下列何者與此病變最相關？
A. Candida albicans
B. Chlamydia trachomatis
C. Herpes simplex virus
D. Trichomonas vaginalis

正確答案：B. Chlamydia trachomatis